Clinical trial inclusion criterion:
elevated levels of NT-proBNP (at least >125 pg/ml)

Entity relations:
- Has_qualifier("NT-proBNP", "elevated")
- Has_value("NT-proBNP", "at least >125 pg/ml")